What are the 4 histological types of lung cancer?

There are 4 histological classes of lung cancer, small cell carcinoma and 3 non small cell lung cancer (NSCLC) types, adenocarcinoma, squamous-cell carcinoma, and large-cell carcinoma.